Clinical trial exclusion criterion:
serious concomitant illness and malignant tumor of any kind

Entity relations:
- Has_qualifier("malignant tumor", "any kind")
- Has_temporal("illness", "concomitant")
- Has_qualifier("illness", "serious")